Clinical trial exclusion criterion:
HIV

Annotated entities:
- Condition: "HIV"